Clinical trial inclusion criterion:
performance status ECOG = 2 (Eastern Cooperative Oncology Group)

Entity relations:
- Subsumes("ECOG", "Eastern Cooperative Oncology Group")
- Has_value("ECOG", "= 2")
- OR("performance status", "ECOG")